Los pacientes con un trastorno histriónico de la personalidad presentan o tienen:
1. Una conducta sumisa y pesada; temen la separación.
2. Timidez y sentimientos inadecuados.
3. Una alteración en los circuitos nerviosos que regulan las emociones.
4. Una emocionalidad excesiva y una conducta dirigida a llamar la atención.

Respuesta correcta: 4. Una emocionalidad excesiva y una conducta dirigida a llamar la atención.